下列中腦結構中，何者含傳遞聽覺訊息的神經纖維？
A. 內側蹄系（medial lemniscus）
B. 上丘臂（brachium of superior colliculus）
C. 下丘臂（brachium of inferior colliculus）
D. 脊髓蹄系（spinal lemniscus）

正確答案：C. 下丘臂（brachium of inferior colliculus）